Clinical trial exclusion criterion:
Concomitant use of strong CYP 3A inhibitors or inducers

Annotated entities:
- Drug: "strong CYP 3A inhibitors"
- Drug: "strong CYP 3A inducers"